What is hyperosmia

Hyperosmia is increased olfactory acuity